¿De qué manera se ven afectadas la media y la varianza de una distribución, si a todos los valores de la muestra se les resta 4?:
1. La media disminuye 4 y la varianza no varía.
2. La media disminuye 4 y la varianza 16.
3. La media y varianza no varían.
4. La media no varía y la varianza sí.

Respuesta correcta: 1. La media disminuye 4 y la varianza no varía.